Iodinated contrast allergy that, in the opinion of the Investigator, cannot be adequately premedicated

The above is a clinical trial exclusion criterion. Annotated with entity spans:
[Non-query-able: Iodinated contrast allergy that, in the opinion of the Investigator, cannot be adequately premedicated]